Patient age >= 18 years

The above is a clinical trial inclusion criterion. Annotated with entity spans:
[Person: Patient age] [Value: >= 18 years]